Clinical trial exclusion criterion:
Patients that have had a high tibial osteotomy or femoral osteotomy

Annotated entities:
- Procedure: "high tibial osteotomy"
- Procedure: "femoral osteotomy"